Las fibras trepadoras que llegan a la corteza cerebelosa sinaptan con las células:
1. De Purkinge.
2. Granulosas solamente.
3. Granulosas y estrelladas.
4. De Golgi.

Respuesta correcta: 1. De Purkinge.